Clinical trial inclusion criterion:
Cohort 2: Newly-diagnosed high-grade glioma (World Health Organization [WHO] grade 3 or 4)

Entity relations:
- Has_value("World Health Organization [WHO] grade", "3 or 4")
- AND("high-grade glioma", "World Health Organization [WHO] grade")